Clinical trial exclusion criterion:
Any stroke within 6 months before randomization

Entity relations:
- Has_temporal("stroke", "within 6 months before randomization")